自體抗原與致病微生物之抗原類似 cross reactivity 可以引起疾病，但下列何者並非如此？
A. 黴漿菌感染後之貧血症（anemia after mycoplasma infection）
B. 鏈球菌感染後之腎絲球腎炎（post-streptococcal glomerulonephritis）
C. Grave 氏病（Graves' disease）
D. 風濕熱（rheumatic fever）

正確答案：C. Grave 氏病（Graves' disease）